Clinical trial exclusion criterion:
contraindication to spinal anaesthesia

Annotated entities:
- Condition: "contraindication"
- Procedure: "spinal anaesthesia"